一位52歲男性因為重複問一樣的問題被送來急診，該病人過去有偏頭痛之病史，最近並無外傷病史。身體檢 查發現此患者仍有警覺性及對人的定向感，注意力、遠程記憶（remote memory）及語言功能都還正常，常規之實	室檢查結果都正常。該患者7小時後，症狀自然緩解。最可能的診斷是：
A. 短暫性全面腦失憶（transient global amnesia）
B. 基底偏頭痛（basilar migraine）
C. 失智症（dementia）
D. 癲癇發作後意識混亂（postictal confusion）

正確答案：A. 短暫性全面腦失憶（transient global amnesia）